Clinical trial exclusion criterion:
History or presence of clinically important hepatic or renal disease or other medical disease.

Annotated entities:
- Temporal: "History"
- Condition: "clinically important hepatic disease"
- Condition: "clinically important renal disease"
- Condition: "clinically important other medical disease"